elective Laparoscopic myomectomy patients 24hr post-operative patient controlled analgesia analgesia no mild or severe liver or renal disfunction

The above is a clinical trial inclusion criterion. Annotated with entity spans:
[Line: elective Laparoscopic myomectomy patients] [Line: 24hr post-operative] [Line: patient controlled analgesia analgesia] [Line: no mild or severe liver or renal disfunction]